Clinical trial exclusion criterion:
Pterygium, pinguecula, or corneal scars within the visual axis

Entity relations:
- Has_qualifier("corneal scars", "within the visual axis")
- OR("Pterygium", "pinguecula", "corneal scars")